Multiple gestations

The above is a clinical trial exclusion criterion. Annotated with entity spans:
[Observation: Multiple gestations]